La mejor estrategia para proporcionar información a los pacientes con cáncer es:
1. No informarles para que el paciente no se desespere.
2. Darles toda la información posible para reducir al máximo la incertidumbre que la situación provoca.
3. Centrarse exclusivamente en proporcionar información relevante a los aspectos directamente vinculados con la enfermedad.
4. Adecuar la información a las demandas informativas de los pacientes.
5. Limitarse a ofrecer información a los familiares para que ellos la proporcionen en el momento adecuado al paciente.

Respuesta correcta: 4. Adecuar la información a las demandas informativas de los pacientes.